4. The subject has manifested at least 1 of the following symptoms while standing or had a medical history of 1 of the following when not treated for orthostatic hypotension (OH): dizziness, lightheadedness, feeling faint, or feeling like they might black out.

The above is a clinical trial inclusion criterion. Annotated with entity spans:
4. The subject has manifested [Multiplier: at least 1] of the following symptoms while standing or had a medical history of [Multiplier: 1] of the following when [Negation: not] [Procedure: treated] for [Condition: orthostatic hypotension (OH)]: [Condition: dizziness], [Condition: lightheadedness], [Condition: feeling faint], or [Condition: feeling like they might black out].